Clinical trial exclusion criterion:
Pregnancy or nursing (negative pregnancy blood test)

Entity relations:
- Has_value("pregnancy blood test", "negative")
- Subsumes("Pregnancy", "pregnancy blood test")
- OR("Pregnancy", "nursing")